下列那一種輔具最常用來矯正類風濕性關節炎（rheumatoid arthritis）病人的鈕扣孔變形 （boutonnière deformities）？
A. 豎腕副木（cock-up splint）
B. 環形輔具（ring orthosis）
C. 拖位輔具（resting orthosis）
D. C形（C-bar）夾

正確答案：B. 環形輔具（ring orthosis）